下列那一種症狀不屬於長期吸食鴉片類藥物的戒斷現象？
A. 流淚（lacrimation）
B. 心跳及血壓下降
C. 精神亢奮（agitation）
D. 失眠症（insomnia）

正確答案：B. 心跳及血壓下降